History of myocardial infarction within 6 months prior to randomization.

The above is a clinical trial exclusion criterion. Annotated with entity spans:
History of [Condition: myocardial infarction] [Temporal: within 6 months prior to randomization].